Clinical trial inclusion criterion:
Patients who sign the consent form

Annotated entities:
- Informed_consent: "Patients who sign the consent form"